Clinical trial exclusion criterion:
Patients with high intracranial pressure.

Entity relations:
- Has_value("intracranial pressure", "high")